Which syndrome is caused by deletion of Pds5b in mice?

mice lacking sister chromatid cohesion protein pds5b exhibit developmental abnormalities reminiscent of cornelia de lange syndrome.